Clinical trial exclusion criterion:
Hemoglobin A1c (HbA1C) > 11%

Annotated entities:
- Measurement: "Hemoglobin A1c (HbA1C)"
- Value: "> 11%"